Clinical trial inclusion criterion:
Patients older than 18 years

Annotated entities:
- Person: "years"
- Value: "older than 18"